Clinical trial exclusion criterion:
Patients with clinically significant laboratory abnormalities / disorders other than prostate cancer

Annotated entities:
- Non-query-able: "Patients with clinically significant laboratory abnormalities / disorders other than prostate cancer"